所謂 Kartagener's syndrome 不包括下列那一種疾患？
A. Sinusitis
B. Bronchiectasis
C. Cystic fibrosis
D. Situs inversus

正確答案：C. Cystic fibrosis